Clinical trial exclusion criterion:
Smoking

Annotated entities:
- Condition: "Smoking"